Clinical trial exclusion criterion:
6. Hemoglobin < 10 Gms/dL.

Annotated entities:
- Measurement: "Hemoglobin"
- Value: "< 10 Gms/dL"